Which proteins participate in the formation of the ryanodine receptor quaternary macromolecular complex?

Junctin is a major transmembrane protein in cardiac junctional sarcoplasmic reticulum, which forms a quaternary complex with the ryanodine receptor (Ca(2+) release channel), triadin, and calsequestrin.